Non-English speaking/illiterate

The above is a clinical trial exclusion criterion. Annotated with entity spans:
[Post-eligibility: Non-English speaking/illiterate]